Reva Rubin identifica la conducta materna después del parto en tres etapas:
1. Aceptación, Apoyo y Abandono.
2. Aceptación, Negación y Encuentro.
3. Negación, Afirmación y Dependencia.
4. Afianzamiento, Afirmación y Apoyo.
5. Afrontamiento, Dependencia y Ayuda.

Respuesta correcta: 1. Aceptación, Apoyo y Abandono.